Which diseases can Oncotype DX be used for?

Oncotype can be used for predicting breast cancer and colon cancer recurrence.